Clinical trial exclusion criterion:
Alpha-1-Antitrypsin Deficiency

Annotated entities:
- Condition: "Alpha-1-Antitrypsin Deficiency"